Clinical trial exclusion criterion:
Other exclusions applied

Annotated entities:
- Non-representable: "Other exclusions applied"